Chronic administration (defined as more than 14 days) of immunosuppressants or other immune-modifying drugs within six months prior to the first vaccine dose.

The above is a clinical trial exclusion criterion. Annotated with entity spans:
[Temporal: Chronic] administration (defined as [Temporal: more than 14 days]) of [Drug: immunosuppressants] or [Drug: other immune-modifying drugs] [Temporal: within six months] prior to the first vaccine dose.